What is the role of Tcf3 in the maintenance of pluripotency?

The maintenance of pluripotency in mouse embryonic stem cells relies on a transcriptional network that is fuelled by the activity of three transcription factors (Nanog, Oct4 and Sox2) and balanced by the repressive activity of Tcf3 . A recent report shows that β-catenin modulates the effect of TERRA in mESC maintenance .